18. Any target lesion requires treatment with a device other than percutaneous transluminal coronary angioplasty (PTCA) prior to stent placement (e.g. but not limited to, directional coronary atherectomy, excimer laser, rotational atherectomy, etc.).

The above is a clinical trial exclusion criterion. Annotated with entity spans:
18. Any [Condition: target lesion] [Mood: requires] [Procedure: treatment] with a [Device: device other than percutaneous transluminal coronary angioplasty (PTCA)] [Temporal: prior to stent placement] (e.g. but not limited to, [Procedure: directional coronary atherectomy], [Procedure: excimer laser], [Procedure: rotational atherectomy], etc.).